Patients who has acute cholecystitis,pancreatitis,pancreaticobiliary diseases, especially choledocholithiasis.

The above is a clinical trial exclusion criterion. Annotated with entity spans:
Patients who has [Condition: acute cholecystitis],[Condition: pancreatitis],[Condition: pancreaticobiliary diseases], especially [Condition: choledocholithiasis].